Presence of a cardiac pacemaker or stimulator

The above is a clinical trial exclusion criterion. Annotated with entity spans:
Presence of a [Device: cardiac pacemaker] or stimulator